Must be amenable to randomization into either cohort

The above is a clinical trial inclusion criterion. Annotated with entity spans:
[Post-eligibility: Must be amenable to randomization into either cohort]